胰臟體部腫瘤壓迫下腸繫膜靜脈（inferior mesentery vein）接近脾靜脈（splenic vein）處，下列何者最有可能因阻塞而膨大？
A. 左胃靜脈（left gastric vein）
B. 左結腸靜脈（left colic vein）
C. 左胃網膜靜脈（left gastroepiploic vein）
D. 左腎靜脈（left renal vein）

正確答案：B. 左結腸靜脈（left colic vein）